Clinical trial inclusion criterion:
Isolated target on initial imagery (invasive hepatocellular carcinoma excluded)

Annotated entities:
- Context_Error: "Isolated target on initial imagery (invasive hepatocellular carcinoma excluded)"